Clinical trial exclusion criteria:
Pregnancy
Patients with chronic kidney disease stage with eGFR < 30 ml/min (CKD stage IV and V)
Nephrotic range proteinuria (urinary protein > 3.5 gm/day)
History or renal transplantation
History of multiple myeloma
Known history of hypersensitivity reaction or intolerability to Ace Inh or ARB.

Annotated entities:
- Condition: "Pregnancy"
- Condition: "chronic kidney disease"
- Measurement: "eGFR"
- Value: "< 30 ml/min"
- Condition: "CKD"
- Qualifier: "stage IV"
- Qualifier: "stage V"
- Qualifier: "Nephrotic range"
- Condition: "proteinuria"
- Measurement: "urinary protein"
- Value: "> 3.5 gm/day"
- Measurement: "renal transplantation"
- Temporal: "History"
- Condition: "multiple myeloma"
- Temporal: "History"
- Condition: "hypersensitivity reaction"
- Condition: "intolerability"
- Drug: "Ace Inh"
- Drug: "ARB"
- Temporal: "history"